Anaplasia代表癌細胞的分化程度為何？
A. 良好
B. 中等度
C. 不良
D. 未分化

正確答案：D. 未分化